Any diagnosed cardiovascular, pulmonary, neurological, and/ or orthopedic conditions that would interfere with subject participation

The above is a clinical trial exclusion criterion. Annotated with entity spans:
Any diagnosed [Condition: cardiovascular], [Condition: pulmonary], [Condition: neurological], and/ or [Condition: orthopedic conditions] that would [Qualifier: interfere with subject participation]